Clinical trial exclusion criterion:
History of Acute Myeloid Leukemia (AML) or high risk for AML

Entity relations:
- Subsumes("Acute Myeloid Leukemia", "AML")
- Has_qualifier("risk for AML", "high")
- OR("Acute Myeloid Leukemia", "risk for AML")